Clinical trial inclusion criterion:
LV ejection fraction = 50

Annotated entities:
- Measurement: "LV ejection fraction"
- Value: "= 50"